absence of peritoneal carcinomatosis, central nervous system o bone metastasis.

The above is a clinical trial inclusion criterion. Annotated with entity spans:
[Negation: absence] of [Condition: peritoneal carcinomatosis], [Condition: central nervous system] o [Condition: bone metastasis].